Clinical trial inclusion criterion:
Men and women patients, with age ranging 40-80.

Annotated entities:
- Person: "women"
- Person: "Men"
- Person: "age"
- Value: "ranging 40-80"